Clinical trial exclusion criterion:
Any evidence of clinical autoimmunity.

Entity relations:
- OR("Any evidence of clinical autoimmunity", "autoimmunity")